Inflammatory bowel disease

The above is a clinical trial exclusion criterion. Annotated with entity spans:
[Condition: Inflammatory bowel disease]